Clinical trial exclusion criterion:
the history of thrombocytopenia or other thrombocytopenia with a definite diagnosis

Entity relations:
- Has_qualifier("thrombocytopenia", "other")
- Has_temporal("thrombocytopenia", "history")
- OR("thrombocytopenia", "thrombocytopenia")